Life expectancy <12 months based on investigator's judgement

The above is a clinical trial exclusion criterion. Annotated with entity spans:
[Measurement: Life expectancy] [Value: <12 months] [Non-representable: based on investigator's judgement]